have the ability to follow multi-step commands.

The above is a clinical trial inclusion criterion. Annotated with entity spans:
have the [Condition: ability to follow multi-step commands].